Clinical trial exclusion criterion:
Females of child bearing potential not using acceptable method of birth control prior to or during study

Annotated entities:
- Person: "Females"
- Condition: "child bearing potential"
- Qualifier: "acceptable"
- Observation: "method of birth control"
- Temporal: "prior to study"
- Temporal: "during study"
- Negation: "not"